Se pueden determinar por titulación complexométrica o quelométrica los siguientes metales:
1. Todos sin excepción.
2. Todos menos los metales de transición.
3. Todos menos litio, sodio y potasio.
4. Todos menos los metales alcalinotérreos.
5. Todos menos oro y plata.

Respuesta correcta: 3. Todos menos litio, sodio y potasio.